Clinical trial exclusion criterion:
Current active dental problems including infection of the teeth or jawbone (maxilla or mandibular); dental or fixture trauma, or a current or prior diagnosis of osteonecrosis of the jaw (ONJ), of exposed bone in the mouth, or of slow healing after dental procedures.

Annotated entities:
- Condition: "dental problems"
- Temporal: "Current"
- Condition: "infection of the teeth"
- Condition: "infection of the jawbone"
- Condition: "infection of the maxilla"
- Condition: "infection of the mandibular"
- Condition: "dental trauma"
- Condition: "fixture trauma"
- Temporal: "current"
- Temporal: "prior"
- Condition: "osteonecrosis of the jaw (ONJ)"
- Condition: "exposed bone in the mouth"
- Condition: "slow healing after dental procedures"